Clinical trial inclusion criterion:
No prior prostate radiation or other definitive therapy

Annotated entities:
- Procedure: "prostate radiation"
- Negation: "No"
- Procedure: "definitive therapy"